Clinical trial exclusion criterion:
Participants with congenital or acquired hypogonadism for whom long-term therapy with placebo would not be medically appropriate

Annotated entities:
- Condition: "acquired hypogonadism"
- Condition: "congenital hypogonadism"
- Non-representable: "for whom long-term therapy with placebo would not be medically appropriate"